Must agree to have regular clinic visits (minimum 3-4 per year for SA, 1-2 for mild-moderate asthma).

The above is a clinical trial inclusion criterion. Annotated with entity spans:
[Post-eligibility: Must agree to have regular clinic visits (minimum 3-4 per year for SA, 1-2 for mild-moderate asthma).]